Women with a singleton pregnancy undergoing cesarean section after 37 weeks of gestation.

The above is a clinical trial inclusion criterion. Annotated with entity spans:
[Person: Women] with a [Condition: singleton pregnancy] undergoing [Procedure: cesarean section] [Value: after 37 weeks] of [Measurement: gestation].